El médico de guardia solicita al banco de sangre hemoderivados para un paciente politraumatizado del grupo A+. Si no se dispusiera este, ¿cuál de los siguientes sería el tratamiento alternativo más correcto?
1. Concentrado     de hematíes del grupo AB+ y plasma AB.
2. Concentrado     de hematíes del grupo B+ y plasma AB.
3. Concentrado     de hematíes del grupo 0+ y plasma AB.
4. Concentrado     de hematíes del grupo B+ y plasma B.

Respuesta correcta: 3. Concentrado     de hematíes del grupo 0+ y plasma AB.